HIV infection

The above is a clinical trial exclusion criterion. Annotated with entity spans:
[Condition: HIV infection]